Dementia - diagnosed and/or MoCA score <18

The above is a clinical trial exclusion criterion. Annotated with entity spans:
[Condition: Dementia] - diagnosed and/or [Measurement: MoCA score] [Value: <18]